肉芽腫性葡萄膜炎（granulomatous uveitis）是下列何種疾病的常見併發症？
A. 惡性黑色素瘤（malignant melanoma）
B. 惡性淋巴瘤（malignant lymphoma）
C. 類肉瘤病（sarcoidosis）
D. 紅斑性狼瘡（lupus erythematosus）

正確答案：C. 類肉瘤病（sarcoidosis）